30 歲李先生長得瘦高，前額禿頭，臉頰瘦長，嘴巴總是開著，頸部往前伸出像鵝頸一樣，且患有白內障。兩手無力已有多年，且逐漸加重。李先生的四肢末端皆有肌肉萎縮，肌腱反射下降，但叩診槌敲到肌肉時，肌肉會收縮約10秒鐘，李先生需要手扶膝蓋才能夠從椅子上站起來。李先生最可能患有：
A. myotonic dystrophy
B. Klinefelter syndrome
C. Duchenne muscular dystrophy
D. hereditary motor-sensory neuropathy, type I

正確答案：A. myotonic dystrophy